肋骨處的壁層胸膜（costal parietal pleura）由下列何者支配？
A. 膈神經（phrenic nerve）
B. 肋間神經（intercostal nerve）
C. 迷走神經（vagus nerve）
D. 交感神經幹（sympathetic trunk）

正確答案：B. 肋間神經（intercostal nerve）